Patients who have had a prior abdominal myomectomy

The above is a clinical trial exclusion criterion. Annotated with entity spans:
Patients who have had a [Temporal: prior] [Procedure: abdominal myomectomy]